從左心室失能（dysfunction）到慢性心臟衰竭（heart failure），以致全身性灌流不足（hypoperfusion） ，下列何者最後發生？
A. 周邊血管收縮
B. 神經賀爾蒙活化
C. 鈉鹽滯留（sodium retention）
D. 前三者同時發生

正確答案：A. 周邊血管收縮